Clinical trial exclusion criterion:
Contraindicated to either diuretics or BCAA

Annotated entities:
- Condition: "Contraindicated"
- Drug: "diuretics"
- Drug: "BCAA"